Clinical trial exclusion criterion:
Doubtful availability to complete the study

Annotated entities:
- Post-eligibility: "Doubtful availability to complete the study"